8. Clinically relevant cardiac or pulmonary insufficiency.

The above is a clinical trial exclusion criterion. Annotated with entity spans:
[Parsing_Error: 8.] [Qualifier: Clinically relevant] [Condition: cardiac] or [Condition: pulmonary insufficiency].